Clinical trial exclusion criteria:
immunization with PPV23 within the last year
any confirmed or suspected immunodeficiency condition, including human immunodeficiency virus (HIV) infection, haematological malignancy, or a congenital immunodeficiency
history of allergic disease or reactions likely to be exacerbated by any component of the vaccine
history of allergic disease likely to be stimulated by the vaccination
history or records of immunosuppressive therapy (with the exception of topical corticosteroids) for more than 14 days and within 6 months of vaccination
history or evidence of administration of immunoglobulins and/or any blood products during the study period or within the three months preceding the study vaccine
use of any other investigational or non-registered drug or vaccine during the study period or within 30 days preceding the study vaccine
administration of a vaccine during the period starting one month before the dose of vaccine and ending one month after
pregnancy

Annotated entities:
- Procedure: "immunization"
- Drug: "PPV23"
- Temporal: "within the last year"
- Condition: "immunodeficiency condition"
- Qualifier: "suspected"
- Qualifier: "confirmed"
- Condition: "human immunodeficiency virus infection"
- Condition: "HIV"
- Condition: "haematological malignancy"
- Condition: "congenital immunodeficiency"
- Condition: "allergic disease"
- Condition: "allergic reactions"
- Qualifier: "exacerbated by any component of the vaccine"
- Procedure: "vaccine"
- Condition: "allergic disease"
- Qualifier: "stimulated by the vaccination"
- Procedure: "vaccination"
- Procedure: "immunosuppressive therapy"
- Procedure: "topical corticosteroids"
- Negation: "exception"
- Temporal: "for more than 14 days of vaccination"
- Temporal: "within 6 months of vaccination"
- Reference_point: "vaccination"
- Procedure: "immunoglobulins"
- Procedure: "blood products"
- Temporal: "during the study period"
- Temporal: "within the three months preceding the study vaccine"
- Reference_point: "study period"
- Reference_point: "study vaccine"
- Grammar_Error: "and/or"
- Procedure: "vaccine"
- Procedure: "drug"
- Qualifier: "investigational"
- Qualifier: "non-registered"
- Temporal: "during the study period"
- Temporal: "within 30 days preceding the study vaccine"
- Reference_point: "study period"
- Reference_point: "study vaccine"
- Procedure: "vaccine"
- Temporal: "during the period starting one month before the dose of vaccine and ending one month after"
- Reference_point: "the dose of vaccine"
- Procedure: "vaccine"
- Condition: "pregnancy"